Which models are used for predicting disease progression in Duchenne Muscular Dystrophy?

Models used to predict disease progression of Duchenne Muscular Dyystrophy are: cumulative distribution function using a non-linear mixed effects approach, ...